45 歲女性，經期規則，其右側有一 3 公分之腫瘤，細針穿刺呈浸潤性乳癌（infiltrating duct carcinoma） ，超音波檢查發現已侵犯至胸壁，同側腋下淋巴腺有明顯腫大，依 TNM 系統之臨床分期為第幾期？
A. stageⅠ
B. stageⅡ
C. stageⅢ
D. stageⅣ

正確答案：C. stageⅢ